Clinical trial inclusion criterion:
Total bilirubin less than 1.5 x ULN. NOTE: If the potential participant is taking an indinavir (IDV)- or atazanavir (ATV)-containing regimen at the time of screening, total bilirubin less than or equal to 5 x ULN is acceptable.

Entity relations:
- Has_value("Total bilirubin", "less than 1.5 x ULN")
- AND("regimen", "indinavir (IDV)")
- Has_value("total bilirubin", "less than or equal to 5 x ULN")
- Has_temporal("regimen", "at the time of screening")
- OR("indinavir (IDV)", "atazanavir (ATV)")
- OR("Total bilirubin", "regimen")